Active bleeding or high bleeding risk (severe liver failure, active peptic ulcer, creatinine clearance < 30 mL/min, platelets count < 100.000 mm3);

The above is a clinical trial exclusion criterion. Annotated with entity spans:
[Qualifier: Active] [Condition: bleeding] or [Condition: high bleeding risk] ([Qualifier: severe] [Condition: liver failure], [Qualifier: active] [Condition: peptic ulcer], [Measurement: creatinine clearance] [Value: < 30 mL/min], [Measurement: platelets count] [Value: < 100.000 mm3]);